Clinical trial exclusion criterion:
Clinical visual evidence of candidiasis at Visit 1 (Screening).

Entity relations:
- Has_index("at Visit 1 (Screening)", "Visit 1 (Screening)")
- AND("visual evidence", "candidiasis")